Have symptoms or signs suggestive of current active or latent TB upon medical history, physical examination and/or chest radiograph, or positive Mycobacterium tuberculosis antigen-specific interferon-gamma release assay (IGRA)

The above is a clinical trial exclusion criterion. Annotated with entity spans:
Have symptoms or signs suggestive of [Temporal: current] [Qualifier: active] or [Qualifier: latent] [Condition: TB] upon [Temporal: medical history], [Procedure: physical examination] and/or [Procedure: chest radiograph], or [Value: positive] [Measurement: Mycobacterium tuberculosis antigen-specific interferon-gamma release assay (IGRA)]